What are acoustic reported genes used to detect?

acoustic reporter genes, which are genetic constructs that allow bacterial gene expression to be visualized in vivo using ultrasound,